List the four most important interferonopathies

Inappropriate upregulation of type I IFN signaling and interferon-stimulated gene expression have been linked to several CNS diseases termed "interferonopathies" including Aicardi-Goutieres syndrome, ubiquitin specific peptidase 18 (USP18)-deficiency, haploinsufficiency in A20, otulipenia, familial chiblain lupus.